Clinical trial inclusion criterion:
Measurable or non-measurable disease by Response Evaluation Criteria in Solid Tumor (RECIST) 1.1 will be allowed

Entity relations:
- Subsumes("Response Evaluation Criteria in Solid Tumor", "RECIST")
- Has_value("Response Evaluation Criteria in Solid Tumor", "1.1")